Clinical trial exclusion criterion:
Contraindication for propofol administration

Entity relations:
- AND("Contraindication", "propofol")